How are thyroid hormones involved in the development of diabetic cardiomyopathy?

The diabetic state  is associated with lowered T3 and T4 levels. Thyroid hormone treatment in diabetic cardiomyopathy may partially reverse cardiac dysfunction